Previous exposure to drugs such as fingolimod, natalizumab, alemtuzumab, mitoxantrone and ocrelizumab.

The above is a clinical trial exclusion criterion. Annotated with entity spans:
[Temporal: Previous] exposure to [Drug: drugs] such as [Drug: fingolimod], [Drug: natalizumab], [Drug: alemtuzumab], [Drug: mitoxantrone] and [Drug: ocrelizumab].